Intolerability of tamsulosin or related drugs

The above is a clinical trial exclusion criterion. Annotated with entity spans:
[Condition: Intolerability] of [Drug: tamsulosin] or [Drug: related drugs]